patients with an absolute indication for administration of antibiotics at the moment of ICU admission (meningitis, pneumonia) or a chronic infection for which long-term antibiotic treatment is necessary (endocarditis, osteo-articular infections, mediastinitis, deep abscesses, pneumocystis infection, toxoplasmosis, tuberculosis)

The above is a clinical trial exclusion criterion. Annotated with entity spans:
patients with an absolute [Condition: indication] for administration of [Drug: antibiotics] at the moment of [Visit: ICU] admission ([Condition: meningitis], [Condition: pneumonia]) or a [Condition: chronic infection] for which [Qualifier: long-term] [Procedure: antibiotic treatment] is necessary ([Condition: endocarditis], [Condition: osteo-articular infections], [Condition: mediastinitis], [Condition: deep abscesses], [Condition: pneumocystis infection], [Condition: toxoplasmosis], [Condition: tuberculosis])